Clinical trial exclusion criterion:
pathological obesity

Annotated entities:
- Condition: "pathological obesity"